Hypersensitivity to everolimus, sirolimus or excipient

The above is a clinical trial exclusion criterion. Annotated with entity spans:
[Condition: Hypersensitivity] to [Drug: everolimus], [Drug: sirolimus] or [Drug: excipient]